下列有關微型核糖核酸（micro RNA）之敘述，何者正確？
A. 經修飾後的最終產物大約有 200～300 個核苷酸（nucleotides）
B. 會轉譯出一個 5 kDa 的蛋白質
C. 可由 RNA polymerase II 轉錄製造
D. 可結合特定蛋白質而分解其它蛋白質

正確答案：C. 可由 RNA polymerase II 轉錄製造